Clinical trial exclusion criterion:
Major surgery within 14 days before enrollment.

Entity relations:
- Has_temporal("Major surgery", "within 14 days before enrollment")